一位 22 歲男性，因右側睪丸疼痛腫脹，合併發燒、噁心而至急診就診，有關身體診查及實驗室檢查之判讀，下列敘述何者錯誤？
A. 陰囊外觀的紅腫或硬塊，無法區分副睪－睪丸炎（epididymo-orchitis）或睪丸扭轉（testicular torsion）
B. 右側提睪肌反射（cremasteric reflex）消失，診斷偏向為睪丸扭轉
C. Prehn sign 陽性，診斷偏向為副睪－睪丸炎，可以排除睪丸扭轉的可能
D. 彩色杜卜勒超音波顯示睪丸血流正常或增加，診斷偏向為副睪－睪丸炎

正確答案：C. Prehn sign 陽性，診斷偏向為副睪－睪丸炎，可以排除睪丸扭轉的可能